What is Desomorphine?

Desomorphine is the semi-synthetic opioid claimed to be the main component of krokodil Desomorphine is an opioid misused as "crocodile", a cheaper alternative to heroin